La sedación y la somnolencia que produce la mirtazapina están directamente relacionadas con su interacción con los receptores:
1. 5-HT1.
2. Adrenérgicos 1 y 2.
3. Histaminérgicos H1.
4. GABA.
5. Colinérgicos muscarínicos.

Respuesta correcta: 3. Histaminérgicos H1.